obstructive sleep apnea or recurrent throat infections

The above is a clinical trial inclusion criterion. Annotated with entity spans:
[Condition: obstructive sleep apnea] or [Multiplier: recurrent] [Condition: throat infections]